Clinical trial inclusion criterion:
Taking another PI containing regimens with suppressed viral load. It must be clearly stated in source document that if another PI was used for greater than 2 weeks the regimen was switched to another agent for convenience. Subjects with prior history of PI use may be enrolled, if there is a genotype showing no resistance to Kaletra Other Inclusion criteria

Annotated entities:
- Drug: "PI"
- Procedure: "regimens"
- Measurement: "viral load"
- Value: "suppressed"